La velocidad máxima de una reacción enzimática:
1. Depende de la concentración de sustrato.
2. Depende de la concentración de enzima.
3. Se duplica al duplicar la concentración de sustrato.
4. Es Km/2.
5. Es la misma para todos los enzimas.

Respuesta correcta: 2. Depende de la concentración de enzima.